Corneal ulcer that is smear positive for either bacteria or filamentous fungus

The above is a clinical trial inclusion criterion. Annotated with entity spans:
[Condition: Corneal ulcer] that is [Measurement: smear] [Value: positive] for either [Qualifier: bacteria] or [Qualifier: filamentous fungus]